關於癲癇病兒使用 anticonvulsant 之原則，下列何者錯誤？
A. 一旦確定需要服用則一定要長期且規律使用
B. 對難控制之癲癇病例可以同時多種藥使用
C. 藥物控制失敗最常見之原因是使用藥物劑量不夠
D. 斷然停藥會導致 status epilepticus

正確答案：C. 藥物控制失敗最常見之原因是使用藥物劑量不夠